Clinical trial exclusion criteria:
Current pregnancy
Desire/intent to become pregnant over the course of the study
Women who are less than 6 weeks postpartum
Contraindications to hormonal contraceptive use per package insert, including history of deep vein thrombosis, smoking in women older than 35 years
Current IUD
Unable to comprehend consent material because of language barrier or psychological difficulty

Annotated entities:
- Condition: "pregnancy"
- Observation: "Desire/intent to become pregnant"
- Condition: "pregnant"
- Temporal: "over the course of the study"
- Person: "Women"
- Temporal: "less than 6 weeks postpartum"
- Reference_point: "postpartum"
- Procedure: "hormonal contraceptive"
- Observation: "Contraindications to hormonal contraceptive"
- Condition: "deep vein thrombosis"
- Person: "women"
- Observation: "smoking"
- Value: "older than 35 years"
- Procedure: "IUD"
- Subjective_judgement: "Unable to comprehend consent material because of language barrier or psychological difficulty"